Clinical trial exclusion criterion:
13. Clinically relevant liver function impairment.

Entity relations:
- Has_qualifier("liver function impairment", "Clinically relevant")